Physician discretion

The above is a clinical trial exclusion criterion. Annotated with entity spans:
[Non-query-able: Physician discretion]